¿Cuál es el tratamiento para la depresión infantil con un mayor apoyo empírico?:
1. Terapia familiar sistémica.
2. Terapia de conducta.
3. Terapia de juego.
4. Relajación de Koepen.

Respuesta correcta: 2. Terapia de conducta.